Clinical trial inclusion criterion:
Patients scheduled for supine-positioned elective craniotomy for supratentorial malignant and non-malignant brain tumors 3 cm or larger (measured as the largest diameter in any plane on MR images)

Entity relations:
- Has_negation("malignant", "non")
- Has_qualifier("brain tumors", "3 cm or larger")
- Has_qualifier("brain tumors", "malignant")
- Has_qualifier("brain tumors", "supratentorial")
- Has_qualifier("3 cm or larger", "largest diameter in any plane")
- Has_mood("supine-positioned elective craniotomy", "scheduled")
- AND("supine-positioned elective craniotomy", "brain tumors")
- AND("3 cm or larger", "MR")
- OR("malignant", "malignant")